Chronic use of opioid

The above is a clinical trial exclusion criterion. Annotated with entity spans:
[Multiplier: Chronic use] of [Drug: opioi]d